Clinical trial exclusion criterion:
open abdominal surgeries except simple appendectomy and common OB/GYN procedures in the pelvis (hysterectomy, C-section, and oophorectomy, tubal ligation)

Annotated entities:
- Procedure: "open abdominal surgeries"
- Procedure: "simple appendectomy"
- Procedure: "common OB/GYN procedures"
- Qualifier: "pelvis"
- Procedure: "hysterectomy"
- Procedure: "C-section"
- Procedure: "oophorectomy"
- Procedure: "tubal ligation"
- Negation: "except"